Clinical trial exclusion criterion:
Patient refusal for supraclavicular block

Annotated entities:
- Observation: "Patient refusal"
- Procedure: "supraclavicular block"